Clinical trial exclusion criterion:
End of last exacerbation less than 6 weeks prior to screening/re-screening visit.

Entity relations:
- Has_index("less than 6 weeks prior to screening/re-screening visit", "screening/re-screening visit")
- Has_temporal("exacerbation", "less than 6 weeks prior to screening/re-screening visit")